El tratamiento de elección para el Trastorno por Estrés Postraumático en la infancia es:
1. La reestructuración cognitiva.
2. La exposición, tanto en imaginación como en vivo.
3. No se ha demostrado ningún tratamiento más eficaz que el resto.
4. Planificación de actividades agradables y entrenamiento en habilidades sociales.
5. La técnica de relajación por sí sola, ha demostrado ser más eficaz que el resto.

Respuesta correcta: 2. La exposición, tanto en imaginación como en vivo.